scheduled to receive ISB and general anesthesia as a day surgery patient for rotator cuff repair and acromioplasty, as a part of planned routine care

The above is a clinical trial inclusion criterion. Annotated with entity spans:
scheduled to receive [Procedure: ISB] and [Procedure: general anesthesia] as a [Qualifier: day surgery] patient for [Procedure: rotator cuff repair] and [Procedure: acromioplasty], as a part of planned routine care